Clinical trial exclusion criterion:
Hemophagocytic syndrome.

Annotated entities:
- Condition: "Hemophagocytic syndrome"